Intracranial tumour, vascular malformation or arterial aneurysm;

The above is a clinical trial exclusion criterion. Annotated with entity spans:
[Condition: Intracranial tumour], [Condition: vascular malformation] or [Condition: arterial aneurysm];